Clinical trial exclusion criterion:
Pneumonectomy

Annotated entities:
- Procedure: "Pneumonectomy"